Clinical trial exclusion criteria:
irreversible status of primary disease
any history of malnutrition before enrollment
history of steroid cortisol administration
severe liver dysfunction (Child-Pugh Score C)
pregnancy
refuse to enrollment
re-admission to ICU and has been enrolled during former admission to ICU

Annotated entities:
- Qualifier: "irreversible status"
- Condition: "primary disease"
- Condition: "malnutrition"
- Temporal: "before enrollment"
- Drug: "steroid cortisol"
- Qualifier: "severe"
- Condition: "liver dysfunction"
- Measurement: "Child-Pugh Score"
- Value: "C"
- Condition: "pregnancy"
- Informed_consent: "refuse to enrollment"
- Procedure: "re-admission"
- Visit: "ICU"
- Non-representable: "has been enrolled during former admission to ICU"